Clinical trial exclusion criterion:
Hydrocephalus with ventricular drain

Annotated entities:
- Condition: "Hydrocephalus"
- Device: "ventricular drain"